Clinical trial inclusion criterion:
Subject has anatomical structures or physiological performance that would interfere with implant utilization.

Entity relations:
- AND("interfere with utilization", "implant")
- Has_context("anatomical structures", "interfere with utilization")
- OR("anatomical structures", "physiological performance")